下列有關運動終板膜電位（end plate potential）之敘述，何者正確？
A. 發生在骨骼肌肌細胞膜上，屬於興奮性膜電位（excitatory membrane potential）
B. 發生在運動神經元細胞膜上，屬於興奮性膜電位（excitatory membrane potential）
C. 發生在骨骼肌肌細胞膜上，屬於抑制性膜電位（inhibitory membrane potential）
D. 發生在運動神經元細胞膜上，屬於抑制性膜電位（inhibitory membrane potential）

正確答案：A. 發生在骨骼肌肌細胞膜上，屬於興奮性膜電位（excitatory membrane potential）